La RNA polimerasa dependiente de DNA de eucariotas y procariotas es inhibida por:
1. Rifampicina.
2. α-Amanitina.
3. Oligomicina.
4. Estreptomicina.
5. Actinomicina D.

Respuesta correcta: 5. Actinomicina D.